Meets the Diagnostic and Statistical Manual (DSM) IV and DSM-V diagnostic criteria for generalised anxiety disorder (GAD) based on structured interview (Mini International Neuropsychiatric Interview-Plus 6 [MINI-Plus 6]. Note that while the MINI-Plus 6 uses the DSM-IV criteria, the same criteria are used in the DSM-V).

The above is a clinical trial inclusion criterion. Annotated with entity spans:
Meets the [Measurement: Diagnostic and Statistical Manual (DSM) IV and DSM-V diagnostic criteria] for [Condition: generalised anxiety disorder] ([Condition: GAD]) based on [Procedure: structured interview] ([Procedure: Mini International Neuropsychiatric Interview-Plus 6 [MINI-Plus 6]]. Note that while the MINI-Plus 6 uses the DSM-IV criteria, the same criteria are used in the DSM-V).